Clinical trial inclusion criterion:
All patients referred to a participating research centre with suspicion of or confirmed endometrial cancer.

Entity relations:
- Has_mood("endometrial cancer", "suspicion of")
- OR("suspicion of", "confirmed")